Participating in another study involving an investigational medication

The above is a clinical trial exclusion criterion. Annotated with entity spans:
[Competing_trial: Participating in another study involving an investigational medication]